Clinical trial inclusion criterion:
The patient has a confirmed GAA enzyme deficiency from skin, blood, or muscle tissue and/or 2 confirmed GAA gene mutations.

Entity relations:
- Has_multiplier("GAA gene mutations", "2")
- Has_qualifier("GAA enzyme deficiency", "skin")
- OR("skin", "blood", "muscle tissue")